Clinical trial inclusion criterion:
biologic therapy (e.g., bevacizumab) as part of their primary treatment regimen or part of their treatment for management of recurrent or persistent disease.

Entity relations:
- Subsumes("biologic therapy", "bevacizumab")
- Has_temporal("disease", "recurrent")
- AND("treatment", "disease")
- Subsumes("primary treatment regimen", "biologic therapy")
- Subsumes("primary treatment regimen", "treatment")
- OR("recurrent", "persistent")